Stable tacrolimus dose for at least 2 weeks prior to randomization

The above is a clinical trial inclusion criterion. Annotated with entity spans:
[Qualifier: Stable] [Drug: tacrolimus] dose [Temporal: for at least 2 weeks prior to randomization]